Clinical trial inclusion criterion:
Undergoing elective primary, revision, or second stage re-implantation total or uni compartmental knee replacement;

Entity relations:
- Has_qualifier("knee replacement", "primary")
- Has_qualifier("knee replacement", "elective")
- OR("primary", "revision", "second stage re-implantation total", "uni compartmental")